Clinical trial exclusion criterion:
Proteinuria >1 gram/day at time of possible conversion

Entity relations:
- Has_value("Proteinuria", ">1 gram/day")
- Has_temporal("Proteinuria", "at time of possible conversion")